Clinical trial inclusion criteria:
liver transplant

Annotated entities:
- Procedure: "liver transplant"